¿Cómo se denomina el conjunto de disregulaciones del sistema nervioso neurovegetativo y de las funciones psíquicas básicas, que persisten durante un largo periodo de tiempo, meses o años, después de conseguirse la abstinencia?
1. Tolerancia cruzada.
2. Síndrome de Korsakoff.
3. Intoxicación aguda.
4. Síndrome de abstinencia tardío.
5. Trastorno dual.

Respuesta correcta: 4. Síndrome de abstinencia tardío.